HCV RNA viral load of ≥ 10*5* IU/mL (100,000 IU/mL) at screening

The above is a clinical trial inclusion criterion. Annotated with entity spans:
[Measurement: HCV RNA viral load] of [Value: ≥ 10*5* IU/mL] ([Value: 100,000 IU/mL]) [Temporal: at screening]